Clinical trial exclusion criterion:
Positive family history for ITP

Annotated entities:
- Observation: "family history for ITP"
- Parsing_Error: "Positive"